Clinical trial exclusion criterion:
Subject requires uni or bilateral facetectomy to treat leg/back pain.

Entity relations:
- Has_qualifier("facetectomy", "uni")
- AND("facetectomy", "back pain")
- OR("uni", "bilateral")
- OR("back pain", "pain leg")